Clinical trial exclusion criterion:
1) preoperative diagnosis of delirium or dementia; 2) MMSE score of = 20 out of 30 on preoperative testing (more than mild cognitive impairment) or delirium on preoperative CAM testing; 3) language barriers that would preclude testing; 4) preoperative steroid use within 3 days of surgery; or 5) anticipation of postoperative intubation.

Entity relations:
- Has_temporal("delirium", "preoperative")
- Has_value("MMSE score", "= 20 out of 30")
- Has_qualifier("cognitive impairment", "more than mild")
- Subsumes("MMSE score", "cognitive impairment")
- Has_temporal("MMSE score", "preoperative")
- Has_temporal("CAM testing", "preoperative")
- AND("CAM testing", "delirium")
- multi("surgery", "surgery")
- Has_index("within 3 days of surgery", "surgery")
- Has_temporal("steroid", "preoperative")
- Subsumes("preoperative", "within 3 days of surgery")
- Has_mood("intubation", "anticipation")
- Has_temporal("intubation", "postoperative")
- OR("delirium", "dementia")
- OR("MMSE score", "CAM testing")